Clinical trial inclusion criterion:
Regular menstrual cycles with duration between 24-35 days

Entity relations:
- AND("Regular menstrual cycles", "duration")
- Has_value("duration", "between 24-35 days")